下列何者不涉及膜融合（membrane fusion）？
A. 細胞內吞作用（endocytosis）
B. 包膜病毒（enveloped virus）進入細胞
C. 葡萄糖進入細胞
D. 細胞外釋作用（exocytosis）

正確答案：C. 葡萄糖進入細胞